Serum creatinine >2.5 mg/dL in men, or >2.0 mg/dL in women

The above is a clinical trial exclusion criterion. Annotated with entity spans:
[Measurement: Serum creatinine] [Value: >2.5 mg/dL] in [Person: men], or [Value: >2.0 mg/dL] in [Person: women]